一位 7 歲男孩因在學校學習能力欠佳，而被帶到兒科門診。依據母親的敘述這個男孩常會推打其他同學，上課時坐立不安，容易分心，注意力不集中，在家裏喜歡破壞玩具，到處跑動，不容易專注。 依上述來看最可能的診斷是：
A. mental retardation
B. attention-deficit / hyperactivity disorder
C. Tourette's syndrome
D. autism

正確答案：B. attention-deficit / hyperactivity disorder